Clinical trial inclusion criterion:
Men or women aged 18-60 years.

Entity relations:
- Has_value("aged", "18-60 years")
- OR("Men", "women")